Clinical trial exclusion criterion:
Received immunoglobulins or any blood products within 180 days prior to informed consent.

Entity relations:
- Has_index("within 180 days prior to informed consent", "informed consent")
- Has_temporal("immunoglobulins", "within 180 days prior to informed consent")
- OR("immunoglobulins", "blood products")